insufficient contraception (only for substudy 3)

The above is a clinical trial exclusion criterion. Annotated with entity spans:
[Qualifier: insufficient] [Procedure: contraception] (only for substudy 3)